Clinical trial exclusion criterion:
Diagnosed or suspected local gynecologic lesion (polyp, adenomyosis, myoma, malignancy or cervical pathology).

Annotated entities:
- Condition: "local gynecologic lesion"
- Mood: "Diagnosed"
- Mood: "suspected"
- Condition: "polyp"
- Condition: "adenomyosis"
- Condition: "myoma"
- Condition: "malignancy"
- Condition: "cervical pathology"